Patients with chronic thromboembolic pulmonary hypertension (CTEPH)

The above is a clinical trial inclusion criterion. Annotated with entity spans:
Patients with [Condition: chronic thromboembolic pulmonary hypertension (CTEPH)]